Clinical trial exclusion criterion:
Is pregnant, planning pregnancy or breast feeding (female subjects of childbearing potential must have negative pregnancy test prior to vaccination).

Annotated entities:
- Condition: "pregnant"
- Mood: "planning pregnancy"
- Observation: "breast feeding"
- Person: "female"
- Observation: "childbearing potential"
- Value: "negative"
- Measurement: "pregnancy test"
- Temporal: "prior to vaccination"
- Procedure: "vaccination"
- Reference_point: "vaccination"